What are Syndecans?

Syndecans are important mediators of signalling by transmitting external stimuli into the cells.  Syndecans (SDCs) are a family of heparan sulfate proteoglycans (HSPGs) glycoproteins ubiquitously expressed on the cell surfaces and extracellular matrix of all mammalian tissues Syndecans are transmembrane proteoglycans that, together with integrins, control cell interactions with extracellular matrix components.